What is the drug target for Eliquis (Apixaban)?

The new oral anticoagulants (NOAC) Apixaban (Eliquis) is a direct anti-Xa inhibitors